pregnant or breast feeding females

The above is a clinical trial exclusion criterion. Annotated with entity spans:
[Condition: pregnant] or [Observation: breast feeding] [Person: females]